Una de las recomendaciones en la alimentación para las personas de edad avanzada es:
1. Fomentar la diversificación de alimentos para asegurar la presencia de todos los nutrientes.
2. Preparar e ingerir abundantes alimentos destinados a mejorar la salud, siendo susceptible de modificarse.
3. Realizar la elección de cualquier producto o sustancia que tenga características organolépticas.
4. Asegurar el consumo de grasas y azúcar para completar el aporte de nutrientes.

Respuesta correcta: 1. Fomentar la diversificación de alimentos para asegurar la presencia de todos los nutrientes.